Federico ha perdido hace tiempo a su mujer y desde entonces ha perdido la creencia en el poder espiritual que tenía. Además muestra una actitud pasiva, sin implicación en los cuidados y sin iniciativa. ¿Cuál es la situación final que puede producirse, de entre los siguientes diagnósticos?:
1. Aflicción crónica.
2. Impotencia.
3. Deterioro del rol.
4. Desesperanza.

Respuesta correcta: 4. Desesperanza.